Clinical trial inclusion criterion:
Possible or probable Alzheimer's disease (National Institute of Neurological and Communicative Disorders and Stroke - Alzheimer's Disease and Related Disorders Association (NINCDS-ADRDA) criteria), with Mini-Mental State Exam (MMSE) score of 10-26 inclusive; MMSE scores above 26 in those who nevertheless meet criteria for AD may be allowed with Steering Committee approval on a case by case basis

Entity relations:
- AND("Alzheimer's disease", "National Institute of Neurological and Communicative Disorders and Stroke - Alzheimer's Disease and Related Disorders Association (NINCDS-ADRDA) criteria")
- Has_value("National Institute of Neurological and Communicative Disorders and Stroke - Alzheimer's Disease and Related Disorders Association (NINCDS-ADRDA) criteria", "Possible")
- Has_value("MMSE", "scores above 26")
- Has_value("Mini-Mental State Exam (MMSE)", "score of 10-26 inclusive")
- OR("Possible", "probable")
- OR("Mini-Mental State Exam (MMSE)", "MMSE")